the last vaccination intervals = 14 days and the last attenuated live vaccine intervals=28days

The above is a clinical trial inclusion criterion. Annotated with entity spans:
the [Observation: last vaccination intervals] [Value: = 14 days] and the [Observation: last attenuated live vaccine intervals][Value: =28days]